Clinical trial exclusion criterion:
Age <1m or > 24 months of age

Entity relations:
- Has_value("Age", "<1m or > 24 months of age")